previous gastrointestinal surgery

The above is a clinical trial exclusion criterion. Annotated with entity spans:
previous [Procedure: gastrointestinal surgery]